局部麻醉劑 xylocaine 中毒最早出現的症狀為何？
A. 視覺障礙（visual disturbance）及肌肉抽筋（muscle twitching）
B. 失去知覺（unconsciousness）及搐搦（convulsion）
C. 舌頭麻木感（numbness of tongue）及頭暈感（lightheadness）
D. 昏迷、呼吸及心跳等抑制

正確答案：C. 舌頭麻木感（numbness of tongue）及頭暈感（lightheadness）